Primaquine 的殺傷對象主要是瘧原蟲的那些發育期？
A. 血液裂殖體（blood schizonts）、肝臟裂殖體（liver schizonts）及休眠體（hypnozoites）
B. 肝臟裂殖體（liver schizonts）、休眠體（hypnozoites）及配子母細胞（gametocytes）
C. 休眠體（hypnozoites）、配子母細胞（gametocytes）及血液裂殖體（blood schizonts）
D. 配子母細胞（gametocytes）、血液裂殖體（blood schizonts）及孢子體（sporozoites）

正確答案：B. 肝臟裂殖體（liver schizonts）、休眠體（hypnozoites）及配子母細胞（gametocytes）